Known severe renal (creatinine clearance <30ml/min) or hepatic insufficiency as well as Alanine transaminase (ALT)/aspartate transaminase (AST) elevations = 3xUpper limit normal (ULN); isolated AST-elevation is not considered an exclusion criteria from study participation

The above is a clinical trial exclusion criterion. Annotated with entity spans:
Known [Qualifier: severe] [Condition: renal] ([Measurement: creatinine clearance] [Value: <30ml/min]) or [Condition: hepatic insufficiency] as well as [Measurement: Alanine transaminase (ALT)]/[Measurement: aspartate transaminase (AST)] [Value: elevations] = [Value: 3xUpper limit normal (ULN)]; isolated AST-elevation is not considered an exclusion criteria from study participation